Clinical trial inclusion criterion:
Normal liver function (defined as aspartate aminotransferase 10-40 U/L and alanine aminotransferase 7-56 U/L)

Annotated entities:
- Condition: "Normal liver function"
- Measurement: "aspartate aminotransferase"
- Value: "10-40 U/L"
- Measurement: "alanine aminotransferase"
- Value: "7-56 U/L"